Clinical trial exclusion criterion:
Inability of oral drug intake

Entity relations:
- multi("oral drug intake", "oral drug")
- multi("Inability of", "Inability")
- Has_mood("oral drug intake", "Inability of")